Clinical trial inclusion criterion:
Informed consent of parent(s) or legal guardian; informed consent or assent of subject as applicable.

Annotated entities:
- Observation: "Informed consent of parent"
- Observation: "Informed consent of legal guardian"
- Observation: "informed consent of subject"
- Observation: "informed assent of subject"